Hematocrit (Hct) > 50%

The above is a clinical trial exclusion criterion. Annotated with entity spans:
[Measurement: Hematocrit (Hct)] [Value: > 50%]